Clinical trial exclusion criterion:
Person who weighs less than 50kg.

Annotated entities:
- Person: "weighs"
- Value: "less than 50kg"